List 4 drugs used to treat opioid addiction or overdose

Suboxone (buprenorphine/naloxone) and  methadone are used to assist in opioid withdrawal and Naloxone is used to treat overdoses